Clinical trial exclusion criterion:
9. Patients who have previously received AC220

Annotated entities:
- Drug: "AC220"